List two medication included in the Juluca pill.

Juluca® pill includes dolutegravir and rilpivirine. It is the first two-drug single-tablet regimen (STR) to be approved for the treatment of HIV-1 infection in adults.